腸胃道中含有大量IgA，在黏膜免疫反應中可以有效阻斷病原菌入侵人體，相關的敘述何者最正確？
A. 血清與腸胃道中2種IgA亞型的抗體比例一致
B. 細胞激素IL-12可以促進B細胞分泌IgA
C. 分泌型IgA上的分泌片段（secretory component）是由上皮細胞合成的
D. 病原菌抗原結合IgA，可以有效啟動補體古典活化路徑

正確答案：C. 分泌型IgA上的分泌片段（secretory component）是由上皮細胞合成的